下列何者無法延長藥物的作用時間？
A. 高脂溶性
B. 與組織蛋白結合
C. 腎臟功能衰竭
D. 誘發 cytochrome P450 酵素

正確答案：D. 誘發 cytochrome P450 酵素